Clinical trial inclusion criterion:
Patients requiring a primary total knee replacement

Annotated entities:
- Procedure: "primary total knee replacement"